Clinical trial inclusion criterion:
Written informed consent.

Annotated entities:
- Informed_consent: "Written informed consent."